All adult patients with chronic myeloid leukaemia in any phase (chronic, accelerated or blastic) who undergo allogeneic stem cell transplantation between 01/01/2010 and 30/09/2013 and have been previously treated with Nilotinib or Dasatinib, regardless of their response to these drugs.

The above is a clinical trial inclusion criterion. Annotated with entity spans:
All [Person: adult] patients with [Condition: chronic myeloid leukaemia] in [Qualifier: any phase] ([Qualifier: chronic], [Qualifier: accelerated] or [Qualifier: blastic]) who undergo [Procedure: allogeneic stem cell transplantation] [Temporal: between 01/01/2010 and 30/09/2013] and have been [Temporal: previously] treated with [Drug: Nilotinib] or [Drug: Dasatinib], regardless of their response to these drugs.